9. Had never received an analgesic regimen that contained lidocaine or gabapentin

The above is a clinical trial inclusion criterion. Annotated with entity spans:
9. Had never received an [Drug: analgesic regimen] that contained [Drug: lidocaine] or [Drug: gabapentin]